Clinical trial exclusion criterion:
Chronic musculoskeletal lesion

Annotated entities:
- Condition: "Chronic musculoskeletal lesion"